一位 62 歲之男性患者已有 15 年高血壓之病史，但他並不規律服藥，所以血壓一直居高不下；半年前，他的右手與右腳突然無力，醫師診斷為左大腦之梗塞，他的認知功能也在此次中風後明顯下降，已達失智症之診斷標準。下列對於此種失智症之敘述，何者正確？
A. 為 70 至 80 歲之老人最常見之失智症
B. 女性較易罹患此症
C. 不會同時罹患阿滋海默氏病
D. 為老人第二常見之失智症

正確答案：D. 為老人第二常見之失智症